真菌之無性孢子（asexual spores）可分成那兩大類？
A. 分生孢子（conidia）及囊孢子（sporangiospores）
B. 瓶孢子（phialides）及分節孢子（arthrospores）
C. 厚膜孢子（chlamydospores）及分節孢子（arthrospores）
D. 分節孢子（arthrospores）及芽生孢子（blastospores）

正確答案：A. 分生孢子（conidia）及囊孢子（sporangiospores）